Clinical trial exclusion criterion:
Age under 18 years old or greater than 75 years old

Entity relations:
- Has_value("Age", "under 18 years old or greater than 75 years old")